Left ventricular ejection fraction less than 50 per cent

The above is a clinical trial exclusion criterion. Annotated with entity spans:
[Measurement: Left ventricular ejection fraction] [Value: less than 50 per cent]